Meningeal signs are present

The above is a clinical trial exclusion criterion. Annotated with entity spans:
[Condition: Meningeal signs] are present